下列何者不是Kasabach-Merritt Syndrome的主要病徵？
A. Kaposiform hemangioendothelioma
B. thrombocytopenia
C. immune mediated hemolytic anemia
D. acute or chronic consumptional coagulopathy

正確答案：C. immune mediated hemolytic anemia